Explain the action of Balovaptan.

Yes, Balovaptan, an investigational vasopressin 1a receptor antagonist that has been evaluated for improvement of social communication and interaction.